Entre las estrategias que utiliza la enfermera en el cuidado de los niños de 2 años se encuentra el juego. Señale cuál de los que se enuncian a continuación favorece la comprensión del proceso de enfermedad y la terapia:
1. Correpasillos.
2. Variaciones del cu-cu o escondite.
3. Siluetas corporales para pintar o muñecos para señalar.
4. Consolas de juegos electrónicos.
5. El teléfono móvil.

Respuesta correcta: 3. Siluetas corporales para pintar o muñecos para señalar.